Clinical trial inclusion criterion:
Women aged above 16 years

Entity relations:
- Has_value("aged", "above 16 years")